En toxicología, la probabilidad de que se produzcan efectos adversos, nocivos para la salud, por exposición a un agente tóxico se conoce como:
1. Peligro.
2. Exposición.
3. Riesgo.
4. Respuesta.
5. Efecto.

Respuesta correcta: 3. Riesgo.